以巴金森症與自主神經障礙為主要的神經症候群為：
A. 肌躍-肌張力不全症（myoclonus-dystonia syndrome, MDS）
B. 多發系統退化症（multiple system atrophy）
C. 漸行性核上麻庳（progressive supranuclear palsy）
D. 皮質基底核退化症（corticobasal degeneration）

正確答案：B. 多發系統退化症（multiple system atrophy）